Clinical trial inclusion criterion:
No previous treatment with Clopidogrel, Prasugrel or Ticagrelor.

Annotated entities:
- Negation: "No"
- Drug: "Clopidogrel"
- Drug: "Prasugrel"
- Drug: "Ticagrelor"
- Temporal: "previous"
- Procedure: "treatment"